下列何者位於膀胱的側下方？
A. 子宮
B. 前列腺
C. 輸尿管
D. 閉孔內肌

正確答案：D. 閉孔內肌